A diagnosis of cancer (other than superficial squamous or basal cell skin cancer) in the past 3 years or current treatment for the active cancer.

The above is a clinical trial exclusion criterion. Annotated with entity spans:
A diagnosis of [Condition: cancer] ([Negation: other than] [Condition: superficial squamous] or [Condition: basal cell skin cancer]) [Temporal: in the past 3 years] or current [Procedure: treatment] for the [Qualifier: active] [Condition: cancer].